Any stroke within 6 months before randomization

The above is a clinical trial exclusion criterion. Annotated with entity spans:
Any [Condition: stroke] [Temporal: within 6 months before randomization]